age <2 years

The above is a clinical trial inclusion criterion. Annotated with entity spans:
[Person: age] [Value: <2 years]